Clinical trial exclusion criterion:
Endoscopically confirmed gastric and/or duodenal ulcers on Day 1.

Annotated entities:
- Qualifier: "Endoscopically confirmed"
- Procedure: "Endoscopically"
- Condition: "gastric"
- Condition: "duodenal ulcers"
- Temporal: "on Day 1"
- Reference_point: "Day 1"